Clinical trial exclusion criterion:
Life expectancy less than 3 months

Entity relations:
- Has_value("Life expectancy", "less than 3 months")